A life expectancy of at least 3 months;

The above is a clinical trial inclusion criterion. Annotated with entity spans:
A [Observation: life expectancy] of [Value: at least 3 months];